Un hombre de treinta y cinco años (caso índice) afecto de ataxia y con manifestaciones clínicas desde hace tres años, presenta una mutación expansiva trinucleotídica CAG en heterocigosis en el gen ATXN1. El diagnóstico molecular es de ataxia espinocerebelosa tipo 1 (SCA1; 6p22.3) y en el informe genético se dice que la enfermedad es de penetrancia completa a lo largo de la vida. En el consejo genético se explicarán al caso índice los riesgos de transmitir la enfermedad a su descendencia. ¿Qué se deduce de lo expuesto?
1. Al ser el caso índice varón, heredarán la ataxia todos los descendientes de sexo femenino; pero ningún hijo varón.
2. La mutación se transmitirá al 50% de los descendientes del caso índice, que desarrollarán la ataxia a partir de algún momento de su vida.
3. La mutación se transmitirá al 25% de los descendientes del caso índice, que desarrollarán la ataxia a partir de algún momento de su vida.
4. La ataxia se transmitirá a lo largo de la vida del caso índice afectando a toda su descendencia.
5. Si la pareja del caso índice es portadora de otra mutación SCA (por ejemplo en SCA36, gran heterogeneidad genética), la ataxia la padecerán el 25% de los descendientes a partir de algún momento de su vida. Si la pareja no es portadora, la ataxia no se transmitirá.

Respuesta correcta: 2. La mutación se transmitirá al 50% de los descendientes del caso índice, que desarrollarán la ataxia a partir de algún momento de su vida.